Contraindications to MRI scanning including cardiac pacemaker, metallic objects and metallic implants contraindicating MRI, cardiac stent, claustrophobia;

The above is a clinical trial exclusion criterion. Annotated with entity spans:
[Condition: Contraindications] to [Procedure: MRI] scanning including [Device: cardiac pacemaker], [Device: metallic objects] and [Device: metallic implants] contraindicating MRI, [Device: cardiac stent], [Condition: claustrophobia];